Clinical trial inclusion criterion:
Asymptomatic women 45-68 years, residents in the Piedmont Region, attending the regional breast cancer screening program

Entity relations:
- Has_value("women", "45-68 years")